Eplerenone之藥理作用敘述，何者錯誤？
A. 會促進鹽分排除
B. 會引起男性女乳症
C. 會使血鉀增加
D. 會抑制aldosterone之作用

正確答案：B. 會引起男性女乳症